漢他病毒（Hanta virus）是一種 emerging virus，下列那一個描述是對的？
A. 此病毒屬於沙狀病毒（Arenavirus）
B. 此病毒是藉由人對人的傳播
C. 此病毒有 antigenic variation 特性
D. 此病毒會造成類似感冒症狀，接著造成呼吸器官傷害

正確答案：D. 此病毒會造成類似感冒症狀，接著造成呼吸器官傷害